24歲男性思覺失調症（schizophrenia）患者，因為拒服藥一年致症狀惡化，醫師評估後，給予haloperidol 針劑肌肉注射，12小時後，個案突然出現眼球上吊、脖子僵硬及軀幹扭曲，下列敘述，何者最正確？
A. 為癲癇發作，須給予抗癲癇藥物
B. 為急性肌肉失張（acute dystonia），宜立即給予抗乙醯膽鹼藥物肌肉注射
C. 為遲發性運動失調（tardive dyskinesia），宜換成第二代抗精神病藥物
D. 抗焦慮劑為其禁忌用藥

正確答案：B. 為急性肌肉失張（acute dystonia），宜立即給予抗乙醯膽鹼藥物肌肉注射